What is the role of the Mcm2-Ctf4-Polα axis?

The Mcm2-Ctf4-Polα Axis Facilitates Parental Histone H3-H4 Transfer to Lagging Strands.